transit nodules not surgically resectable

The above is a clinical trial inclusion criterion. Annotated with entity spans:
[Condition: transit nodules] [Negation: not] [Qualifier: surgically resectable]